Which main ribotype of Clostridium difficile is responsible of the recent outbreak?

The outbreak of the hypervirulent strain belonging to ribotype 027 has increased the incidence and severity of CDI in some countries.